Clinical trial inclusion criterion:
Free of obvious health problems as established by medical history and clinical examination before entering into the study.

Entity relations:
- Has_qualifier("health problems", "obvious")
- Has_negation("health problems", "Free")